Describe applications of the CHALICE rule?

The children's head injury algorithm for the prediction of important clinical events (CHALICE) is one of the strongest clinical prediction rules for the management of children with head injuries. It can be used to predict death, need for neurosurgical intervention or CT abnormality in children with head trauma.